Clinical trial exclusion criterion:
Immunosuppressive therapy before operation

Entity relations:
- Has_index("before operation", "operation")
- multi("operation", "operation")
- Has_temporal("Immunosuppressive therapy", "before operation")